Clinical trial inclusion criterion:
Patient capable of understanding information about the study and of giving his/her consent

Annotated entities:
- Post-eligibility: "Patient capable of understanding information about the study and of giving his/her consent"